下列有關心雜音的敍述，何者錯誤？
A. 在 mid-systolic click 之後的 late systolic murmur 常發生在僧帽瓣脫垂（mitral valve prolapse）的病人
B. 僧帽瓣閉鎖不全（mitral regurgitation）多為 holosystolic murmur
C. 主動脈狹窄（aortic stenosis）為 mid-systolic ejection murmur，並可傳到頸部
D. 開放性動脈導管的病人主要聽到舒張期雜音（diastolic murmur）

正確答案：D. 開放性動脈導管的病人主要聽到舒張期雜音（diastolic murmur）